Clinical trial exclusion criterion:
paraben allergy

Entity relations:
- AND("allergy", "paraben")